Acquired thrombophilia.

The above is a clinical trial exclusion criterion. Annotated with entity spans:
[Qualifier: Acquired] [Condition: thrombophilia].